Clinical trial inclusion criteria:
≥18 years of age undergoing open-heart surgery (sternotomy, including minimally-invasive sternotomies)

Annotated entities:
- Value: "≥18 years"
- Person: "age"
- Procedure: "open-heart surgery"
- Temporal: "undergoing"
- Procedure: "sternotomy"
- Procedure: "minimally-invasive sternotomies"